Clinical trial exclusion criterion:
Current treatment with antiplatelet therapy

Entity relations:
- Has_temporal("antiplatelet therapy", "Current")